What is the half-life of epimutations across generations of C. elegans?

In C. elegans, epimutations typically have short half-lives of two to three generations. Nevertheless, some epimutations last at least ten generations.